Clinical trial inclusion criterion:
Septic shock patients despite early goal directed therapy

Annotated entities:
- Condition: "Septic shock"
- Procedure: "early goal directed therapy"